有關波雷特氏食道（Barrett esophagus）的敘述，下列何者錯誤？
A. 是逆流性食道炎（reflux esophagitis）的併發症
B. 好發於白人男性
C. 是食道腺癌（adenocarcinoma）的危險因子之一
D. 組織學特徵是在食道壁看見壁細胞（parietal cell）和主細胞（chief cell）

正確答案：D. 組織學特徵是在食道壁看見壁細胞（parietal cell）和主細胞（chief cell）